Clinical trial exclusion criterion:
Patients with any active or uncontrolled infection, including known HIV infection. (Patients with active hepatitis B will be placed on lamivudine. Patients with active hepatitis C will be eligible if liver tests qualify (5.1.9)

Entity relations:
- Has_qualifier("infection", "uncontrolled")
- Subsumes("infection", "HIV infection")
- Has_qualifier("hepatitis B", "active")
- AND("hepatitis B", "lamivudine")
- Has_qualifier("hepatitis C", "active")
- Has_value("liver tests", "qualify")
- AND("hepatitis C", "liver tests")
- Has_qualifier("infection", "active")